Clinical trial inclusion criterion:
5. AP ≥ 1.67 × ULN

Annotated entities:
- Parsing_Error: "5."
- Measurement: "AP"
- Value: "≥ 1.67 × ULN"